Poor compliance or refusal to participate.

The above is a clinical trial exclusion criterion. Annotated with entity spans:
[Observation: Poor compliance] or [Observation: refusal to participate].